Clinical trial inclusion criterion:
Eastern Cooperative Oncology Group (ECOG) score of 0, 1 or 2 (patients that spend less than 50% of time in bed during the day)

Entity relations:
- Has_value("Eastern Cooperative Oncology Group (ECOG) score", "0, 1 or 2")
- Has_value("spend time in bed during the day", "less than 50%")
- Subsumes("Eastern Cooperative Oncology Group (ECOG) score", "spend time in bed during the day")